Clinical trial inclusion criteria:
The cirrhotic malnourished patients who were diagnosed as liver cancer preoperatively and underwent hepatectomy were consecutively enrolled.

Annotated entities:
- Condition: "cirrhotic"
- Condition: "malnourished"
- Condition: "liver cancer"
- Temporal: "preoperatively"
- Procedure: "hepatectomy"